25歲女性，左乳外上側，離乳暈3公分，約 1公分×1公分腫瘤，經粗針切片是浸潤性管道癌（infiltrating ductal carcinoma），女性荷爾蒙接受器（estrogen receptor）陽性，黃體素荷爾蒙接受器（progesterone receptor）陽性，HER-2/neu 陽性，下列何者是最適合的建議？
A. 左乳房全切除手術
B. 左外側乳房部分切除
C. 左外側乳房部分切除加上前哨淋巴結切除術
D. 荷爾蒙治療即可，不需要手術

正確答案：C. 左外側乳房部分切除加上前哨淋巴結切除術